Clinical trial exclusion criterion:
Treated with an investigational RA drug in the last 6 months

Entity relations:
- Has_temporal("RA drug", "in the last 6 months")
- Has_qualifier("RA drug", "investigational")